Clinical trial exclusion criterion:
Subjects with a supine BP >140 mm Hg systolic or >90 mm Hg diastolic or <100 mm Hg systolic or <60 mm Hg diastolic based on the average of the triplicate

Annotated entities:
- Measurement: "supine BP"
- Value: ">140 mm Hg systolic"
- Value: ">90 mm Hg diastolic"
- Value: "<100 mm Hg systolic"
- Value: "<60 mm Hg diastolic"